Clinical trial inclusion criterion:
Is willing to comply with the visit schedule

Annotated entities:
- Non-query-able: "Is willing to comply with the visit schedule"
- Post-eligibility: "Is willing to comply with the visit schedule"